Actúa sobre las células de Sertoli:
1. Testosterona.
2. Hormona luteinizante (LH).
3. Hormona folículo estimulante (FSH).
4. Hormonas liberadoras de FSH/LH.

Respuesta correcta: 3. Hormona folículo estimulante (FSH).